Clinical trial inclusion criterion:
7. Normal laboratory values or clinically insignificant findings at screening as determined by the Investigator;

Entity relations:
- Has_value("laboratory", "Normal")
- Has_qualifier("findings", "clinically insignificant")
- Has_index("at screening", "screening")